Clinical trial inclusion criterion:
Failure of conservative treatment for at least 3 months;

Entity relations:
- Has_context("conservative treatment", "Failure")
- Has_temporal("Failure", "for at least 3 months")